Clinical trial exclusion criterion:
Estimated Glomerular Filtration Rate (eGFR) < 30 ml/min

Annotated entities:
- Measurement: "Estimated Glomerular Filtration Rate (eGFR)"
- Value: "< 30 ml/min"